Clinical trial exclusion criterion:
Arterial disease (ABPI<0.8)

Annotated entities:
- Condition: "Arterial disease"
- Measurement: "ABPI"
- Value: "<0.8"